Clinical trial exclusion criterion:
Unable to read and understand the Danish language or to give informed consent

Entity relations:
- OR("Unable to read", "Unable to give informed consent", "Unable to understand the Danish language")